positive drug screen or alcohol breathalyzer

The above is a clinical trial exclusion criterion. Annotated with entity spans:
[Value: positive] [Measurement: drug screen] or [Measurement: alcohol breathalyzer]